一位63歲的男性退休記者被診斷得了失智症，過去沒有高血壓或糖尿病，也不曾發生腦中風。他在發病後不久，就經常出現視幻覺，尤其是看到小孩子在客廳玩耍，白天看電視時，常常就睡	了。2個月後這位病人的動作變得比較慢，但不至於跌倒。此時，最有可能的診斷是？
A. Alzheimer disease
B. dementia with Lewy bodies
C. Parkinson disease with dementia
D. vascular dementia

正確答案：B. dementia with Lewy bodies